What medication were compared in the ROCKET AF Trial?

ROCKET-AF trial compared rivaroxaban and warfarin for for prevention of stroke and embolism.